Clinical trial exclusion criterion:
Hypotension (Systolic blood pressure <100 mmHg)

Entity relations:
- Has_value("Systolic blood pressure", "<100 mmHg")
- Subsumes("Hypotension", "Systolic blood pressure")